Clinical trial exclusion criterion:
Liver cirrhosis,

Annotated entities:
- Condition: "Liver cirrhosis"